Clinical trial exclusion criterion:
Regular smoking and other regular nicotine use.

Entity relations:
- Has_multiplier("smoking", "Regular")
- Has_multiplier("nicotine", "regular")
- OR("smoking", "nicotine")